Clinical trial exclusion criterion:
previous history of respiratory disease other than COPD

Entity relations:
- Has_negation("COPD", "other than")
- AND("respiratory disease", "COPD")
- Has_temporal("respiratory disease", "previous history")